List two chemotherapeutic agents that are used for treatment of Subependymal Giant Cell Astrocytoma

Everolimus and rapamycin are chemotherapeutic agents that are used for treatment of Subependymal Giant Cell Astrocytoma.